Low or high amount of calcium in blood

The above is a clinical trial exclusion criterion. Annotated with entity spans:
[Value: Low] or [Value: high amount] of [Measurement: calcium in blood]